Female participants who are breastfeeding or pregnant at Screening or Baseline (as documented by a positive beta-human chorionic gonadotropin test). A separate Baseline assessment is required if a negative screening pregnancy test was obtained more than 72 hours before the first dose of study drug.

The above is a clinical trial exclusion criterion. Annotated with entity spans:
[Person: Female] participants who are [Observation: breastfeeding] or [Condition: pregnant] [Temporal: at Screening] or Baseline (as documented by a [Value: positive] [Measurement: beta-human chorionic gonadotropin test]). A [Qualifier: separate] [Procedure: Baseline assessment] is required if a [Value: negative] [Measurement: screening pregnancy test] was obtained [Temporal: more than 72 hours before the first dose of study drug].